List 3 human diseases caused by  viruses in the family Paramyxoviridae.

Viruses in the family Paramyxoviridae can cuase , measles, mumps and encephalitis as well as respiratory illness in humans.